El oxígeno que consumimos en la cadena respiratoria se transforma en:
1. Acetil-CoA.
2. Dióxido de carbono.
3. Monóxido de carbono.
4. Agua.
5. Ácido carbónico.

Respuesta correcta: 4. Agua.